Los triglicéridos son los lípidos más abundantes en:
1. Quilomicrones.
2. LDL.
3. VHDL.
4. HDL.

Respuesta correcta: 1. Quilomicrones.